王先生 35 歲，腹瀉 10 天，糞便量少但次數頻繁且有黏液，同時有發燒及下腹痛，若糞便中出現白血球，最可能的致病菌為何？
A. Staphylococcus aureus
B. Enterobius vermicularis
C. Entamoeba histolytica
D. Clostridium perfringens

正確答案：C. Entamoeba histolytica